Clinical trial exclusion criterion:
Heart failure NYHA III to IV

Annotated entities:
- Condition: "Heart failure"
- Measurement: "NYHA"
- Value: "III to IV"